Clinical trial exclusion criterion:
Having cancer or have received treatment for cancer within three years (persons with a history of cancer who are disease-free without treatment for three years or more are eligible), excluding minor skin cancers, which are allowed unless located at the vaccination site

Annotated entities:
- Condition: "cancer"
- Condition: "cancer"
- Procedure: "treatment for cancer"
- Temporal: "within three years"
- Condition: "cancer"
- Temporal: "history"
- Condition: "disease-free"
- Procedure: "treatment"
- Negation: "without"
- Temporal: "for three years or more"
- Grammar_Error: "are eligible"